Clinical trial inclusion criterion:
Able to perform a visible contraction with dorsiflexor and hip flexor muscles (allowing testing of largely impaired patients)

Annotated entities:
- Non-representable: "Able to perform a visible contraction with dorsiflexor and hip flexor muscles (allowing testing of largely impaired patients)"